Clinical trial exclusion criterion:
Previous radiotherapy for the treatment of unresectable, locally advanced or metastatic breast cancer is not allowed if more than 25% of marrow-bearing bone has been irradiated or the last fraction of radiotherapy has been administered within approximately 3 weeks prior to randomization.

Annotated entities:
- Procedure: "radiotherapy"
- Temporal: "Previous"
- Condition: "breast cancer"
- Qualifier: "metastatic"
- Qualifier: "locally advanced"
- Qualifier: "unresectable"
- Value: "more than 25%"
- Measurement: "marrow-bearing bone irradiated"
- Non-representable: "Previous radiotherapy for the treatment of unresectable, locally advanced or metastatic breast cancer is not allowed if more than 25% of marrow-bearing bone has been irradiated or the last fraction of radiotherapy has been administered within approximately 3 weeks prior to randomization."